下列有關大面積燒傷引起的微血管反應，何者正確？
A. 靜水壓（hydrostatic pressure）下降
B. 微血管壓（capillary pressure）上升
C. 血液滲透壓（oncotic pressure）上升
D. 微血管壁滲透性（capillary permeability）上升

正確答案：D. 微血管壁滲透性（capillary permeability）上升